What is GeneWeaver used for?

GeneWeaver: a web-based system for integrative functional genomics.